Clinical trial exclusion criterion:
Unlikely to comply with the study requirements.

Annotated entities:
- Non-query-able: "Unlikely to comply with the study requirements."